Clinical trial exclusion criterion:
Patients who are positive for HCV antibody must be negative for HCV by polymerase chain reaction (PCR) to be eligible for study participation

Entity relations:
- Has_value("HCV antibody", "positive")
- Has_value("HCV", "negative")
- AND("HCV antibody", "HCV")
- AND("HCV", "polymerase chain reaction (PCR)")